Clinical trial inclusion criterion:
20-70 yrs of age

Annotated entities:
- Person: "age"
- Value: "20-70 yrs"